American Spinal Injury Association Impairment Scale A or B

The above is a clinical trial inclusion criterion. Annotated with entity spans:
[Measurement: American Spinal Injury Association Impairment Scale] [Value: A or B]